有關氣道（airway）處理，下列敘述，何者錯誤？
A. 使用二氧化碳偵測儀（Capnography）偵測氣道二氧化碳是確認氣管內管位置最可靠的方法
B. 喉頭痙攣（Laryngospasm）後引起肺水腫主要是由於胸內負壓劇升
C. 喉頭罩氣道（Laryngeal mask airway）可以完全取代氣管內管之使用
D. 處理氣道最常見永久性的傷害是牙齒創傷

正確答案：C. 喉頭罩氣道（Laryngeal mask airway）可以完全取代氣管內管之使用